Clinical trial exclusion criterion:
Type 1 diabetes (autoantibody positive).

Entity relations:
- Has_value("autoantibody", "positive")
- Subsumes("Type 1 diabetes", "autoantibody")